Clinical trial exclusion criterion:
Failure to have fully recovered (that is, less than or equal to [<=] Grade 1 toxicity) from the reversible effects of prior chemotherapy.

Annotated entities:
- Negation: "Failure"
- Condition: "fully recovered"
- Value: "less than or equal to [<=] Grade 1"
- Measurement: "toxicity"
- Procedure: "chemotherapy"